Clinical and radiologic diagnosis of primary knee osteoarthritis (Kellgren & Lawrence I, II or III);

The above is a clinical trial inclusion criterion. Annotated with entity spans:
[Qualifier: Clinical] and [Qualifier: radiologic diagnosis] of [Condition: primary knee osteoarthritis] ([Measurement: Kellgren & Lawrence] [Value: I, II or III]);